林太太 58 歲，患有憂鬱症（depression），平時常感覺手腳冰冷，母親和妹妹有糖尿病。今林太太被診斷患有高血壓，血中 creatinine 1.8 mg/dL。則下列何者是她最不應使用的藥物？
A. alpha-blocker
B. beta-blocker
C. dihydropyridine calcium channel blocker
D. angiotensin-converting enzyme inhibitor

正確答案：B. beta-blocker